finnish or/and swedish speaking

The above is a clinical trial inclusion criterion. Annotated with entity spans:
[Observation: finnish] or/and [Observation: swedish speaking]